關於肥胖（obesity）之敘述，下列何者錯誤？
A. 在臺灣，肥胖的定義是身體質量指數（BMI）大於等於30 Kg/m2
B. 在臺灣，腹部肥胖的定義是女性腰圍大於80 cm，男性大於90 cm
C. 肥胖很常見於Cushing's syndrome
D. craniopharyngioma會引發多食症而造成肥胖

正確答案：A. 在臺灣，肥胖的定義是身體質量指數（BMI）大於等於30 Kg/m2